History of curettage or other intrauterine surgery

The above is a clinical trial exclusion criterion. Annotated with entity spans:
[Temporal: History] of [Procedure: curettage] or other [Procedure: intrauterine surgery]